Respecto a la estructura del DNA
1. Contiene el azúcar fructosa.
2. Las bases nitrogenadas se orientan hacia el exterior.
3. Los componentes monoméricos están unidos por enlaces glicosídicos.
4. Está estabilizada por puentes de hidrógeno entre cadenas diferentes.

Respuesta correcta: 4. Está estabilizada por puentes de hidrógeno entre cadenas diferentes.